下列有關新生兒免疫力的敘述，何者正確？
A. 不具免疫保護能力
B. 透過胎盤獲得母親的 IgM
C. 自身最早製造出來的是 IgM
D. 具有成年人 IgE 的量

正確答案：C. 自身最早製造出來的是 IgM